Clinical trial inclusion criterion:
Diagnosed with spinal cord injury between 3 days and 4 weeks

Annotated entities:
- Condition: "spinal cord injury"
- Temporal: "between 3 days and 4 weeks"